Clinical trial exclusion criteria:
eGFR <45 ml/min
structural and functional urogenital abnormalities, that predispose for urogenital infections
Investigational product use in the last 6 months
SGLT2 inhibitor, TZD, DPP4 inhibitor and GLP1 RA use within the past 6 months
DKA(Diabetic Ketoacidosis) or HHS(Hyperosmoloar Hyperglycaemic Syndrome) within the last 6 months
Pregnancy
Presence of major contraindications to magnetic resonance imaging (cardiac pacemakers, claustrophobia, foreign bodies and implanted medical devices with ferromagnetic properties).
Liver cirrhosis
Type 1 diabetes
Severe uncorrected insulin insufficiency
Significant alcohol intake
HIV infection
Use of Traditional Chinese Medication or alternative therapies
Coexisting causes of chronic liver disease - chronic viral hepatitis(B & C), autoimmune liver disease, hemochromatosis, Wilson's etc.
Use of medications associated with steatosis eg. Methotrexate, anticonvulsants, antiretroviral therapy etc.
h/o stroke
Steroid therapy
Endogenous Cushing's
Familial hypertriglyceridemia

Annotated entities:
- Measurement: "eGFR"
- Value: "<45 ml/min"
- Condition: "urogenital abnormalities"
- Qualifier: "structural"
- Qualifier: "functional"
- Parsing_Error: "and"
- Observation: "predispose for urogenital infections"
- Condition: "urogenital infections"
- Procedure: "Investigational product use"
- Temporal: "in the last 6 months"
- Drug: "SGLT2 inhibitor"
- Drug: "TZD"
- Drug: "DPP4 inhibitor"
- Drug: "GLP1 RA"
- Temporal: "within the past 6 months"
- Condition: "DKA"
- Condition: "Diabetic Ketoacidosis"
- Condition: "HHS"
- Condition: "Hyperosmoloar Hyperglycaemic Syndrome"
- Temporal: "within the last 6 months"
- Pregnancy_considerations: "Pregnancy"
- Procedure: "magnetic resonance imaging"
- Observation: "major contraindications"
- Device: "cardiac pacemakers"
- Condition: "claustrophobia"
- Observation: "foreign bodies"
- Device: "implanted medical devices"
- Qualifier: "ferromagnetic properties"
- Condition: "Liver cirrhosis"
- Condition: "Type 1 diabetes"
- Condition: "insulin insufficiency"
- Qualifier: "uncorrected"
- Qualifier: "Severe"
- Observation: "alcohol intake"
- Qualifier: "Significant"
- Condition: "HIV infection"
- Procedure: "Traditional Chinese Medication"
- Procedure: "alternative therapies"
- Condition: "chronic liver disease"
- Condition: "chronic viral hepatitis B"
- Condition: "chronic viral hepatitis C"
- Parsing_Error: "&"
- Condition: "autoimmune liver disease"
- Condition: "hemochromatosis"
- Condition: "Wilson's"
- Drug: "medications"
- Condition: "steatosis"
- Drug: "Methotrexate"
- Drug: "anticonvulsants"
- Drug: "antiretroviral therapy"
- Condition: "stroke"
- Drug: "Steroid therapy"
- Condition: "Cushing's"
- Qualifier: "Endogenous"
- Condition: "Familial hypertriglyceridemi"